Intolerance or allergy to ASA, clopidogrel or ticlopidine precluding treatment for 12 months

The above is a clinical trial exclusion criterion. Annotated with entity spans:
[Condition: Intolerance] or [Condition: allergy] to [Drug: ASA], [Drug: clopidogrel] or [Drug: ticlopidine] [Negation: precluding] [Procedure: treatment] [Temporal: for 12 months]